下列有關子宮頸上皮內瘤變／鱗狀上皮內病灶（cervical intraepithelial neoplasia/squamous intraepithelial lesions）的敘述， 何者較不正確？
A. 大部分的低度鱗狀上皮內病灶（low-grade squamous intraepithelial lesion, LSIL）會持續存在而不會回復
B. 約有10%的低度鱗狀上皮內病灶（low-grade squamous intraepithelial lesion, LSIL）會進展（progress）成
C. 少數高度鱗狀上皮內病灶（high-grade squamous intraepithelial lesion, HSIL）會回復（regress）
D. 大部分高度鱗狀上皮內病灶（high-grade squamous intraepithelial lesion, HSIL）會持續存在（persist）

正確答案：A. 大部分的低度鱗狀上皮內病灶（low-grade squamous intraepithelial lesion, LSIL）會持續存在而不會回復